Any other condition that the investigator believes might put the participant at risk

The above is a clinical trial exclusion criterion. Annotated with entity spans:
[Post-eligibility: Any other condition that the investigator believes might put the participant at risk]